Being pregnant or having the intention to be pregnant before the end of the study

The above is a clinical trial exclusion criterion. Annotated with entity spans:
[Pregnancy_considerations: Being pregnant or having the intention to be pregnant before the end of the study]